Clinical trial exclusion criterion:
Had an unsatisfactory response to a previous adequate trial of quetiapine as judged by a study investigator.

Annotated entities:
- Non-query-able: "Had an unsatisfactory response to a previous adequate trial of quetiapine as judged by a study investigator"